Clinical trial exclusion criterion:
CYP2C9 substrates such as tolbutamide (because of expected inhibition of the metabolism of CYP2C9 substrates by venetoclax. It is recommended to exclude CYP2C9 substrates with a narrow therapeutic index such as phenytoin.

Annotated entities:
- Drug: "CYP2C9 substrates"
- Drug: "tolbutamide"
- Drug: "CYP2C9 substrates"
- Drug: "phenytoin"
- Qualifier: "narrow therapeutic index"
- Subjective_judgement: "It is recommended to exclude CYP2C9 substrates with a narrow therapeutic index such as phenytoin"